Clinical trial exclusion criterion:
Gestational diabetes;

Annotated entities:
- Condition: "Gestational diabetes"